Clinical trial exclusion criterion:
neurofibromatosis

Annotated entities:
- Condition: "neurofibromatosis"